Clinical trial inclusion criteria:
Patients underwent percutaneous coronary intervention with drug-eluting stent;

Annotated entities:
- Procedure: "percutaneous coronary intervention"
- Device: "drug-eluting stent"